有關先天性扳機拇指（congenital trigger thumb）的敘述，下列何者錯誤？
A. 通常在A2 滑車（pulley）處可觸摸到結節（nodule）
B. 年紀小於九個月大的病患，常有自癒的可能
C. 大部分病例沒有家族史
D. 通常沒有發炎反應

正確答案：A. 通常在A2 滑車（pulley）處可觸摸到結節（nodule）